require combination immunotherapy

The above is a clinical trial exclusion criterion. Annotated with entity spans:
[Mood: require] [Procedure: combination immunotherapy]